Clinical trial inclusion criterion:
Scheduled for bilateral varus rotational osteotomy (VRO) with or without associated soft tissue and osseous procedures

Annotated entities:
- Qualifier: "bilateral"
- Mood: "Scheduled for"
- Procedure: "varus rotational osteotomy"
- Procedure: "VRO"
- Procedure: "osseous procedures"
- Procedure: "procedures soft tissue"